Clinical trial inclusion criterion:
All pacing capture thresholds (PCT) do not exceed 2.0 V @0.4 or 0.5 ms in pacemaker dependent patients

Entity relations:
- Subsumes("pacing capture thresholds", "PCT")
- Has_value("pacing capture thresholds", "do not exceed 2.0 V @0.4 or 0.5 ms")
- AND("pacemaker dependent", "pacing capture thresholds")